patient living without parental supervision.

The above is a clinical trial exclusion criterion. Annotated with entity spans:
[Non-representable: patient living without parental supervision.]